The selection of the subjects will be at the discretion of the individual investigator

The above is a clinical trial inclusion criterion. Annotated with entity spans:
[Non-representable: The selection of the subjects will be at the discretion of the individual investigator]